Patients on a legal protection regime type guardianship

The above is a clinical trial exclusion criterion. Annotated with entity spans:
Patients on a [Person: legal protection regime type guardianship]